How many Groucho-related genes (GRG) are contained in the mouse genome?

We have isolated cDNAs representing multiple members of murine groucho homologues, designated Grg for groucho-related genes.  The groucho-related genes (Grg) of the mouse comprise at least four family members.